下列有關單發性內生軟骨瘤（Single enchondroma）的敘述，何者正確？
A. 最常發病部位為股骨和肱骨
B. 病灶部位的骨髓腔會膨大，皮質骨會增厚
C. 腫瘤細胞分裂增長快速
D. 少數病患會發生惡性變化，形成軟骨肉瘤

正確答案：D. 少數病患會發生惡性變化，形成軟骨肉瘤